IL-10 es una citocina:
1. Inmunosupresora.
2. Proinflamatoria.
3. Asociada a respuestas Th2.
4. Que activa a los linfocitos Th1.
5. Producida por linfocitos CD8.

Respuesta correcta: 1. Inmunosupresora.